靜脈注射類鴉片麻醉藥物（Opioids）時，臨床上常可觀察到有心跳減緩（Bradycardia）的現象，但下列何者例外？
A. Morphine
B. Meperidine
C. Fentanyl
D. Alfentanil

正確答案：B. Meperidine